周邊神經（peripheral nerve）完全切斷是屬於 Sunderland 分類的那一類損傷？
A. 第二類
B. 第三類
C. 第四類
D. 第五類

正確答案：D. 第五類